空氣污染是日常生活所關切的環境問題。空氣污染物的成分很複雜，例行監測的污染物有一氧化碳、氮氧化物、二氧化硫、臭氧及微粒等，特殊的情況也測定揮發性有機物。這些污染物中含量最多且最容易和血紅素結合的是：
A. 氧
B. 一氧化碳
C. 臭氧
D. 二氧化 硫

正確答案：B. 一氧化碳